Clinical trial exclusion criterion:
Women who are breast-feeding

Annotated entities:
- Person: "Women"
- Condition: "breast-feeding"